4. Patient with at least an assessment of the response to Eribulin

The above is a clinical trial inclusion criterion. Annotated with entity spans:
[Parsing_Error: 4.] [Non-query-able: Patient with at least an assessment of the response to Eribulin]